Clinical trial inclusion criterion:
Stoke since less than 2 month

Entity relations:
- Has_temporal("Stoke", "since less than 2 month")